下列那一項病變是腦脫疝的後果，且常致命？
A. 腦室旁白質軟化（periventricular encephalomalacia）
B. Kernohan 氏凹痕（Kernohan's notch）
C. 繼發性（Duret）腦幹出血
D. 瀰漫性軸突損傷（diffuse axonal injury）

正確答案：C. 繼發性（Duret）腦幹出血